在生物體內，質體（plasmid）DNA 以負超螺旋結構（negative supercoiling）存在，這代表其 linking number（Lk）為何？
A. Lk＞Lk0
B. Lk＝Lk0
C. Lk＜Lk0
D. 無法判斷

正確答案：C. Lk＜Lk0